Las gotas nasales:
1. Deben ser isoosmóticas o ligeramente hipertónicas.
2. Deben prepararse a pH 3-5,5.
3. Deben ser estériles.
4. Deben estar exentas de conservantes.

Respuesta correcta: 1. Deben ser isoosmóticas o ligeramente hipertónicas.